Clinical trial exclusion criterion:
The participant is required to take any of the excluded medications or treatments.

Annotated entities:
- Post-eligibility: "The participant is required to take any of the excluded medications or treatments."
- Context_Error: "The participant is required to take any of the excluded medications or treatments."